Clinical trial exclusion criterion:
Irregular pulse, or pulse 100 or higher.

Annotated entities:
- Measurement: "pulse"
- Value: "Irregular"
- Measurement: "pulse"
- Value: "100 or higher"